Clinical trial exclusion criterion:
Current viral or bacterial infection.

Entity relations:
- Has_temporal("bacterial infection", "Current")
- OR("bacterial infection", "infection viral")